hospital admission for COPD exacerbation

The above is a clinical trial inclusion criterion. Annotated with entity spans:
hospital [Visit: admission] for [Condition: COPD exacerbation]